Clinical trial inclusion criterion:
Children 7-17 with moderate to severe pain requiring around the clock treatment with an opioid analgesic.

Entity relations:
- AND("around the clock treatment", "opioid analgesic")
- Has_qualifier("pain", "moderate")
- AND("pain", "around the clock treatment")
- OR("moderate", "severe")